Clinical trial exclusion criterion:
Known Immunoglobulin E (IgE)-mediated hypersensitivity to eggs manifested as hives, swelling of the mouth and throat, difficulty in breathing, hypotension, or shock

Entity relations:
- AND("Immunoglobulin E (IgE)-mediated hypersensitivity", "eggs")
- AND("Immunoglobulin E (IgE)-mediated hypersensitivity", "hives")
- OR("hives", "hypotension", "difficulty in breathing", "swelling of the throat", "swelling of the mouth", "shock")